The patient or his/her representative must have given free and informed consent and signed the consent

The above is a clinical trial inclusion criterion. Annotated with entity spans:
[Informed_consent: The patient or his/her representative must have given free and informed consent and signed the consent]